Clinical trial inclusion criterion:
Patients who provide written informed consent for the study.

Annotated entities:
- Informed_consent: "Patients who provide written informed consent for the study."